¿Dónde se localizan los barorreceptores que juegan un papel más importante en la regulación de la presión arterial?
1. Vasos del bulbo raquídeo.
2. Arterias coronarias.
3. Vena cava.
4. Arterias carótidas.
5. Arterias renales.

Respuesta correcta: 4. Arterias carótidas.